Subjects with blood disorders.

The above is a clinical trial exclusion criterion. Annotated with entity spans:
Subjects with [Condition: blood disorders].